La práctica de una radiografía posteroanterior de tórax en espiración forzada es de gran utilidad para el diagnóstico de:
1. Derrame pleural loculado.
2. Neumotórax mínimo.
3. Hemotórax.
4. Atelectasia pulmonar.
5. Pericarditis.

Respuesta correcta: 2. Neumotórax mínimo.